¿Cuál de los siguientes fármacos indicaría como tratamiento de primera línea en un paciente de 53 años diagnosticado de cáncer renal de células claras metastásico?
1. Sunitinib.
2. Cetuximab.
3. Fluoropirimidina.
4. Panitumumab.
5. Bleomicina.

Respuesta correcta: 1. Sunitinib.